Clinical trial exclusion criterion:
2. Persistent hypotension at Screening.

Annotated entities:
- Parsing_Error: "2."
- Condition: "Persistent hypotension"
- Temporal: "at Screening"
- Reference_point: "Screening"